Clinical trial exclusion criterion:
3. Planned need for major surgery (e.g. valve surgery or resection of aortic or left ventricular aneurysm, carotid end-arterectomy, abdominal aortic aneurysm surgery etc.);

Entity relations:
- OR("major surgery", "carotid end-arterectomy", "resection of aortic aneurysm", "abdominal aortic aneurysm surgery", "valve surgery", "resection of left ventricular aneurysm")